Clinical trial inclusion criterion:
Sustained monomorphic VT documented on 12-lead ECG or rhythm strip terminated by pharmacologic means or DC cardioversion

Entity relations:
- Has_qualifier("monomorphic VT", "Sustained")
- AND("12-lead ECG", "monomorphic VT")
- AND("pharmacologic means", "monomorphic VT")
- OR("12-lead ECG", "rhythm strip")
- OR("pharmacologic means", "DC cardioversion")